葡萄糖進行醣解反應（glycolysis）之終產物為 pyruvate，當病人發生休克（shock）而組織缺氧時 （hypoxia），抽血檢驗下列何種 pyruvate 下游產物濃度會上升？
A. ethanol
B. acetyl-CoA
C. lactate
D. ATP

正確答案：C. lactate